升結腸（ascending colon）的靜脈匯入下列何者？
A. 下腸繫膜靜脈（inferior mesenteric vein）
B. 肝靜脈（hepatic vein）
C. 門靜脈（portal vein）
D. 脾靜脈（splenic vein）

正確答案：C. 門靜脈（portal vein）